Clinical trial inclusion criterion:
recurrent severe hypoglycemic episodes or high glucose variability

Entity relations:
- Has_qualifier("hypoglycemic episodes", "severe")
- Has_multiplier("hypoglycemic episodes", "recurrent")
- OR("hypoglycemic episodes", "high glucose variability")